Clinical trial inclusion criterion:
Age greater than or equal to 18 years and less than 80 years

Annotated entities:
- Person: "Age"
- Value: "greater than or equal to 18 years and less than 80 years"